El D-gliceraldehído y la dihidroxiacetona:
1. Presentan un carbono asimétrico.
2. Son aldosas.
3. Son enantiómeros.
4. Presentan actividad óptica.
5. Tienen la misma fórmula.

Respuesta correcta: 5. Tienen la misma fórmula.